兩血管兩端壓力差、血液黏稠度、管線長度等條件均一致的狀況下，單位時間內流經管徑為4公分血管的血流量為2公分血管之血流量的幾倍？
A. 2倍
B. 4倍
C. 8倍
D. 16倍

正確答案：D. 16倍